對於肝衰竭病患的全靜脈營養給予原則，下列何項不妥？
A. 選用支鏈性胺基酸（branched chain amino acids）
B. 能量給予應>35 Kcal/kg/day
C. 選用中鏈性脂肪酸（MCT fat）
D. 如果黃膽指數過高，應改採用循環式（cyclic TPN）給予

正確答案：B. 能量給予應>35 Kcal/kg/day